Una mujer de 73 años es traída a Urgencias acompañada por la familia por un cuadro de escalofríos y tos productiva de moco purulento de unos 2 días de evolución; además refieren tendencia a la somnolencia con disminución de la ingesta oral tanto a líquidos como a sólidos. Como antecedentes nos informan que la paciente está diagnosticada de HTA, DM tipo 2 y demencia incipiente. A la exploración física destaca una paciente delgada, con discreta sequedad mucosa, somnolienta pero reactiva a órdenes verbales. No se objetiva meningismo ni focalidad motora ni sensitiva. Temperatura 35,9ºC. Frecuencia cardiaca 118 lpm, TA 84/50 mmHg, frecuencia respiratoria 22 rpm. Saturación O2 93%. Auscultación cardiaca taquirrítmica     sin    soplos.   Auscultación respiratoria con crepitantes en base derecha. Señale la respuesta VERDADERA:
1. Entre las medidas a tomar cuando se sospecha una sepsis, se encuentra la administración de antibioterapia en la 1ª hora de su llegada, aunque no se ha conseguido relacionar esta actitud con una disminución de la mortalidad.
2. La administración precoz de fluidos iv es esencial para mantener adecuada perfusión tisular, siendo la meta a conseguir mantener una presión arterial media > 65 mmHg.
3. Entre las pruebas complementarias que se reciben observamos un lactato > 5,6 mmol/L; hay que tenerlo en cuenta pero mientras mantenga estabilidad hemodinámica no debemos preocuparnos.
4. En realidad no es correcto el diagnóstico de sepsis ya que la ausencia de fiebre la descarta.
5. La paciente presenta hipotensión a pesar de administración intensiva de fluidoterapia endovenosa; es el momento de administrar drogas vasoactivas, siendo de elección el isoproterenol.

Respuesta correcta: 2. La administración precoz de fluidos iv es esencial para mantener adecuada perfusión tisular, siendo la meta a conseguir mantener una presión arterial media > 65 mmHg.